Clinical trial exclusion criterion:
Subjects were not to have a history of alcohol or drug abuse within 2 years prior to the study (subjects with a history of previous use of cannabis were not excluded unless they had used cannabis or cannabinoid based medicine within 30 days prior to study drug administration or were unwilling to abstain for the duration of the study).

Annotated entities:
- Condition: "drug abuse"
- Condition: "alcohol abuse"
- Temporal: "within 2 years prior to the study"
- Reference_point: "the study"
- Temporal: "history"
- Condition: "use of cannabis"
- Negation: "not excluded"
- Grammar_Error: "not excluded"
- Negation: "not"
- Not_a_criteria: "(subjects with a history of previous use of cannabis were not excluded unless they had used cannabis or cannabinoid based medicine within 30 days prior to study drug administration or were unwilling to abstain for the duration of the study)"